Clinical trial exclusion criterion:
Acute coronary syndrome (ACS) within 3 months.

Annotated entities:
- Condition: "Acute coronary syndrome"
- Condition: "ACS"
- Temporal: "within 3 months"